假設由900核苷酸配對（base pairs）所組成的DNA片段，不含非轉譯部分（untranslated region）。其相對應的mRNA所轉譯產生的多胜肽（polypeptide）之分子量約為多少？
A. 900
B. 5,000
C. 30,000
D. 100,000

正確答案：C. 30,000